1. Stage 4 colon cancer either s/p metastasectomy or post-initial chemotherapy or maintenance "standard of care", either involving 5-fluorouracil/leucovorin (5-FU/LV) alone or continual bevacizumab alone. Patients in maintenance cohort must have had 2 consecutive CT scans showing stable disease and not be experiencing significant prior treatment-related toxicity above Grade 1.

The above is a clinical trial inclusion criterion. Annotated with entity spans:
1. [Qualifier: Stage 4] [Condition: colon cancer] either [Condition: s/p metastasectomy] or [Condition: post-initial chemotherapy] or [Procedure: maintenance "standard of care"], either involving [Drug: 5-fluorouracil/leucovorin (5-FU/LV)] alone or continual [Drug: bevacizumab] alone. Patients in maintenance cohort must have had [Multiplier: 2] consecutive [Procedure: CT scans] showing [Qualifier: stable] [Condition: disease] and [Negation: not] be experiencing significant [Temporal: prior] [Condition: treatment-related toxicity] above Grade 1.